Clinical trial exclusion criterion:
Contraindications for spinal anesthesia (like bleeding diathesis or regional infection at site of neuroaxial block)

Annotated entities:
- Condition: "Contraindications"
- Procedure: "spinal anesthesia"
- Condition: "bleeding diathesis"
- Condition: "regional infection"
- Qualifier: "site of neuroaxial block"